Clinical trial exclusion criterion:
Sick sinus syndrome.

Annotated entities:
- Condition: "Sick sinus syndrome"